若泌尿道阻塞而導致鮑氏囊淨水壓（hydrostatic pressure of the Bowman's capsule）增高時，腎絲球過濾率 （glomerular filtration rate）最可能因此而產生下列何種改變？
A. 反射性增加
B. 快速增加並逐漸趨於穩定
C. 減少
D. 不受影響

正確答案：C. 減少